Clinical trial inclusion criterion:
ASA class 1-4

Annotated entities:
- Measurement: "ASA class"
- Value: "1-4"